Clinical trial exclusion criterion:
3. Were taking class 1 anti-arrhythmic drugs (e.g., mexiletine, tocainide)

Entity relations:
- Subsumes("class 1 anti-arrhythmic drugs", "mexiletine")
- OR("mexiletine", "tocainide")